Clinical trial exclusion criterion:
Systolic Blood Pressure < 80 mmHg / Mean arterial pressure < 50 mmHg on maximal support

Annotated entities:
- Measurement: "Systolic Blood Pressure"
- Value: "< 80 mmHg"
- Measurement: "Mean arterial pressure"
- Value: "< 50 mmHg"
- Qualifier: "on maximal support"
- Procedure: "support"